Un-controlled progressive pathology.

The above is a clinical trial exclusion criterion. Annotated with entity spans:
[Non-query-able: Un-controlled progressive pathology].